Clinical trial inclusion criterion:
Female and male participants of reproductive potential must agree to use adequate contraception starting from the first dose of study medication, throughout the study period, and for up to 120 days after the last dose of study medication

Entity relations:
- AND("Female", "adequate contraception")
- AND("and", "adequate contraception")
- AND("reproductive potential", "adequate contraception")
- OR("Female", "male")